Clinical trial exclusion criterion:
Age less than 18

Annotated entities:
- Person: "Age"
- Value: "less than 18"